Clinical trial exclusion criteria:
With severe systemic alteration;
In the use of antibiotics and anti-inflammatories in the last three months;
With periodontium with periodontal parameters different from those established in the inclusion criteria.
Individuals with clinical signs of parafunctional habits;
Smoking;
Individuals who have performed other restorations in the last 12 months;
Pregnant women and infants;
Periodontal sites that presented bleeding during crevicular fluid collection or sites that prevent proper collection of clinical parameters.

Annotated entities:
- Condition: "systemic alteration"
- Qualifier: "severe"
- Drug: "antibiotics"
- Drug: "anti-inflammatories"
- Temporal: "in the last three months"
- Non-representable: "With periodontium with periodontal parameters different from those established in the inclusion criteria."
- Condition: "clinical signs of parafunctional habits"
- Observation: "Smoking"
- Procedure: "other restorations"
- Temporal: "in the last 12 months"
- Condition: "Pregnant"
- Person: "women"
- Person: "infants"
- Non-representable: "Periodontal sites that presented bleeding during crevicular fluid collection or sites that prevent proper collection of clinical parameters."